Any other condition or circumstance which, in the opinion of the Principal Investigator, poses an unacceptable risk for participation in the study

The above is a clinical trial exclusion criterion. Annotated with entity spans:
[Subjective_judgement: Any other condition or circumstance which, in the opinion of the Principal Investigator, poses an unacceptable risk for participation in the study]